La fosfofructoquinasa-1:
1. Participa en la glucolisis y en la gluconeogénesis.
2. Cataliza una reacción fácilmente reversible.
3. Es una enzima con regulación alostérica.
4. Transfiere directamente un Pi a la fructosa6P.
5. Produce ATP.

Respuesta correcta: 3. Es una enzima con regulación alostérica.